子宮摘除手術結紮子宮動脈（uterine artery）後，仍有出血現象，此血液最可能來自下列何者的分支？
A. 上膀胱動脈（superior vesical artery）
B. 下直腸動脈（inferior rectal artery）
C. 卵巢動脈（ovarian artery）
D. 閉孔動脈（obturator artery）

正確答案：C. 卵巢動脈（ovarian artery）